下列何者參與外生性凝血因子的活化路徑？
A. 第 7 因子
B. 第 5 因子
C. 第 12 因子
D. 第 11 因子

正確答案：A. 第 7 因子